下列有關酒精藥理作用之描述，何者錯誤？
A. 酒精可以經由胃腸道完全吸收
B. 經由靜脈注射的方式投與相同劑量的酒精時，女性血漿中的酒精濃度較男性高
C. 酒精的代謝作用為零級反應（zero-order kinetics）
D. Acetaldehyde為酒精代謝的初級產物

正確答案：B. 經由靜脈注射的方式投與相同劑量的酒精時，女性血漿中的酒精濃度較男性高